Age=18 years and =80 years;

The above is a clinical trial inclusion criterion. Annotated with entity spans:
[Person: Age][Value: =18 years and =80 years];